Serum Alanine Aminotransferase (ALT) > triple the upper limit of the normal range; and/or

The above is a clinical trial exclusion criterion. Annotated with entity spans:
[Measurement: Serum Alanine Aminotransferase] ([Measurement: ALT]) [Value: > triple the upper limit of the normal range]; [Non-query-able: and/or]